Current history or in past 6 months of psychotic disorder or major depressive disorders that is not stable on treatment for past 3 months

The above is a clinical trial exclusion criterion. Annotated with entity spans:
Current history or in [Temporal: past 6 months] of [Condition: psychotic disorder] or [Condition: major depressive disorders] that is [Qualifier: not stable] on treatment [Temporal: for past 3 months]